Which proteins are controlling sterol metabolism in S. cerevisiae?

UCP2 and its major targets ERG11, ERG2, NCP1 as well as Osh1p-Osh7p